Clinical trial inclusion criterion:
over 18 years

Entity relations:
- Has_value("over 18 years", "over 18 years")